一位 80 歲的男性病人因跌倒至急診就診，他的家人拿出他平日在服用的藥物，下列何者最不可能導致他跌倒？
A. alprazolam
B. zolpidem
C. omeprazole
D. chlorothiazide

正確答案：C. omeprazole